Es característico de la hélice alfa:
1. Presentar 3,6 residuos de aminoácidos por cada vuelta.
2. Ser levógira.
3. Estar estabilizada por puentes disulfuro intracatenarios.
4. Presentar enlaces iónicos entre grupos amino y cetona cargados de los enlaces peptídicos.
5. Tener las cadenas laterales de los aminoácidos hacia el interior.

Respuesta correcta: 1. Presentar 3,6 residuos de aminoácidos por cada vuelta.